Psychiatric troubles that do not allow the protocol follow-up.

The above is a clinical trial exclusion criterion. Annotated with entity spans:
[Condition: Psychiatric troubles] that [Qualifier: do not allow the protocol follow-up].